What is the ChIP-exo method used for?

ChIP-exo is a molecular biology method for identifying genomic location of DNA-binding proteins with near-single-nucleotide accuracy.